Clinical trial inclusion criteria:
All patients with esophageal cancer who are deemed candidates for minimally invasive robot assisted Ivor Lewis esophagogastrectomy.
Patients who provide written informed consent for the study.

Annotated entities:
- Condition: "esophageal cancer"
- Observation: "candidates"
- Qualifier: "minimally invasive"
- Qualifier: "robot assisted"
- Qualifier: "Ivor Lewis"
- Procedure: "esophagogastrectomy"
- Informed_consent: "Patients who provide written informed consent for the study."